Clinical trial exclusion criterion:
Had a nontuberculous mycobacterial infection or opportunistic infection within 6 months prior to Screening

Entity relations:
- Has_temporal("nontuberculous mycobacterial infection", "within 6 months prior to Screening")
- OR("nontuberculous mycobacterial infection", "opportunistic infection")